O君（O型，Rh-positive）需要輸血，但A君（A型，Rh-negative）不可以輸血給O君的主要原因為何？
A. O君血液中，具有O抗原之白血球會被具有A抗原之紅血球包覆
B. O君的Rh-positive抗體會使A君的Rh-negative紅血球凝集
C. O君具有白血球上有O抗原會吞噬具有A抗原之紅血球
D. O君的anti-A抗體會使具有A抗原之紅血球溶解

正確答案：D. O君的anti-A抗體會使具有A抗原之紅血球溶解